Clinical trial exclusion criterion:
Received heart transplantation or pacemaker implantation; revascularization treatment within 3 months; or plan to receive above treatment in 6 months.

Annotated entities:
- Procedure: "heart transplantation"
- Procedure: "pacemaker implantation"
- Procedure: "revascularization"
- Temporal: "within 3 months"
- Mood: "plan to"
- Temporal: "in 6 months"
- Procedure: "heart transplantation"
- Procedure: "pacemaker implantation"
- Procedure: "revascularization"